胎兒small for gestational age（SGA）之定義為何？
A. 體重小於10th percentile
B. 體重小於20th percentile
C. 體重小於30th percentile
D. 體重小於40th percentile

正確答案：A. 體重小於10th percentile